Which X chromosome abnormalities present lupus-like symptoms?

genetic abnormality in its Y chromosome, designated Yaa (Y-linked autoimmune acceleration).